¿Cuál de las siguientes afirmaciones sobre la consolidación de las fracturas es FALSA?:
1. La presencia de enfermedades metabólicas inhibe la consolidación.
2. Hay huesos que por su estado de nutrición y aporte sanguíneo consolidan más tarde.
3. En los niños consolidan más rápido.
4. En las fracturas intraarticulares se retrasa la consolidación.
5. El espacio entre los fragmentos favorece la consolidación.

Respuesta correcta: 5. El espacio entre los fragmentos favorece la consolidación.